Which is the mass-tag that reveal the ubiquitination of a lysine residue?

Lys-ɛ-Gly-Gly (K-ɛ-GG) is the remnant produced by trypsin digestion of proteins having ubiquitinated lysine side chains.